Patient with fever (38C or 100.4F)

The above is a clinical trial exclusion criterion. Annotated with entity spans:
Patient with [Condition: fever] ([Value: 38C] or [Value: 100.4F])